Known furosemide hypersensitivity.

The above is a clinical trial exclusion criterion. Annotated with entity spans:
Known [Drug: furosemide] [Condition: hypersensitivity].